Clinical trial exclusion criterion:
Presence of relative or absolute contraindications to CPFA

Entity relations:
- AND("relative contraindications", "CPFA")
- OR("relative contraindications", "absolute contraindications")